Clinical trial inclusion criterion:
White Brazilian of European descent

Annotated entities:
- Person: "White"
- Person: "Brazilian"
- Person: "European descent"